Clinical trial exclusion criterion:
Contraindication to bariatric surgery

Entity relations:
- AND("Contraindication", "bariatric surgery")